Clinical trial inclusion criterion:
Understand the nature of the procedure

Annotated entities:
- Non-query-able: "Understand the nature of the procedure"